Previous myocardial infarction

The above is a clinical trial exclusion criterion. Annotated with entity spans:
[Condition: Previous myocardial infarction]